BMI greater than 35 or less than 20

The above is a clinical trial exclusion criterion. Annotated with entity spans:
[Measurement: BMI] [Value: greater than 35] or [Value: less than 20]